Clinical trial inclusion criteria:
Adult (age 18 years and older)
Patients with end-stage renal disease(ESRD)/chronic kidney disease(CKD)stage 5

Annotated entities:
- Person: "Adult"
- Person: "age"
- Value: "18 years and older"
- Condition: "end-stage renal disease"
- Condition: "ESRD"
- Condition: "chronic kidney disease"
- Condition: "CKD"
- Qualifier: "stage 5"